Clinical trial inclusion criterion:
Patients with a histologically or cytologically proven diagnosis of NSCLC

Annotated entities:
- Condition: "NSCLC"
- Qualifier: "cytologically proven"
- Qualifier: "histologically proven"